Clinical trial inclusion criterion:
Shows high disease activity at Screening and Baseline of both a Total Back Pain score of =4 and a Bath Ankylosing Spondylitis Disease Activity Index (BASDAI) score of >= 4

Annotated entities:
- Measurement: "Total Back Pain score"
- Value: "=4"
- Measurement: "Bath Ankylosing Spondylitis Disease Activity Index (BASDAI) score"
- Value: ">= 4"
- Condition: "high disease activity"
- Temporal: "at Screening and Baseline"